Clinical trial exclusion criterion:
Acute or serious medical illness or unstable chronic medical illness (e.g., unstable angina, myocardial infarction within 6 months, congestive heart failure, clinically significant or concerning cardiac arrhythmias; preexisting hypotension [systolic blood pressure<110] or orthostatic hypotension [systolic drop >20 mm Hg after 2 min standing accompanied by lightheadedness], chronic renal or hepatic failure, acute pancreatitis, Meniere's disease, or diagnosed but untreated sleep apnea). The eligibility of potential participants having acute serious and/or chronic medical illnesses other than those listed will be evaluated on a case-by-case basis by a study physician, PA-C, or ARNP.

Entity relations:
- Has_temporal("myocardial infarction", "within 6 months")
- Has_qualifier("medical illness", "Acute")
- Has_qualifier("chronic medical illness", "unstable")
- Has_qualifier("cardiac arrhythmias", "clinically significant")
- Has_temporal("hypotension", "preexisting")
- Has_value("systolic blood pressure", "<110")
- Has_value("systolic drop", ">20 mm Hg")
- Has_temporal("systolic drop", "after 2 min standing")
- Subsumes("orthostatic hypotension", "systolic drop")
- Has_qualifier("sleep apnea", "untreated")
- Subsumes("hypotension", "systolic blood pressure")
- Subsumes("medical illness", "unstable angina")
- Subsumes("orthostatic hypotension", "lightheadedness")
- OR("clinically significant", "concerning")
- OR("Acute", "serious")
- OR("unstable angina", "orthostatic hypotension", "chronic renal failure", "hepatic failure", "acute pancreatitis", "Meniere's disease", "sleep apnea", "myocardial infarction", "congestive heart failure", "cardiac arrhythmias", "hypotension")
- OR("medical illness", "chronic medical illness")